Clinical trial exclusion criterion:
Patients with Guillain-Barré syndrome radiculopathy of vascular origin.

Annotated entities:
- Condition: "Guillain-Barré syndrome radiculopathy"
- Qualifier: "vascular"